Glaucoma;

The above is a clinical trial exclusion criterion. Annotated with entity spans:
[Condition: Glaucoma];